下列解讀B型肝炎血清標誌之敘述，何者錯誤？
A. IgM anti-HBc可以用來分辨急性或慢性B型肝炎
B. rheumatoid factor（RF）high titer時，IgM anti-HBc有假陽性的可能
C. 慢性B型肝炎急性發作（acute reactivation of chronic hepatitis B）時，IgM anti-HBc可以出現陽性反應
D. antinuclear antibody（ANA）high titer時，IgM anti-HBc有假陽性的可能

正確答案：D. antinuclear antibody（ANA）high titer時，IgM anti-HBc有假陽性的可能